Any condition/illness that may affect the study outcomes or would make participation potentially harmful such as pregnancy or breastfeeding, diabetes mellitus, heart disease, stroke, hypertension, malabsorption syndromes, GERD, a history of ulcer, according to a detailed medical history.

The above is a clinical trial exclusion criterion. Annotated with entity spans:
Any condition/[Condition: illness that may affect the study outcomes] or would make participation potentially harmful such as [Condition: pregnancy] or [Observation: breastfeeding], [Condition: diabetes mellitus], [Condition: heart disease], [Condition: stroke], [Condition: hypertension], [Condition: malabsorption syndromes], [Condition: GERD], a [Temporal: history of] [Condition: ulcer], according to a detailed [Temporal: medical history].